下列有關精神分裂症發病及預後的敘述，何者錯誤？
A. 早發型精神分裂症發病通常為突發性、病程短且預後佳
B. 早發型精神分裂症需與智能障礙及自閉症作鑑別診斷
C. 晚發型精神分裂症通常是指 45 歲以後才發病
D. 晚發型精神分裂症在女性較常見

正確答案：A. 早發型精神分裂症發病通常為突發性、病程短且預後佳